Con respecto al tratamiento de la depresión y, en concreto, a la eficacia comparada entre los tratamientos psicológicos (en especial, la terapia cognitivo-conductual) y los tratamientos farmacológicos se puede afirmar que, en general:
1. Los fármacos para la depresión son más eficaces en pacientes con depresiones severas que los tratamientos psicológicos.
2. Los fármacos para la depresión proporcionan una respuesta de mejoría más rápida que los tratamientos psicológicos.
3. Los fármacos para la depresión tienen un efecto de prevención de recaídas a largo plazo similar a los tratamientos psicológicos.
4. Los fármacos para la depresión tienen un nivel de efectos secundarios similar que los tratamientos psicológicos.
5. Los fármacos para la depresión hacen que la terapia psicológica sea más efectiva en comparación con su aplicación sin medicación.

Respuesta correcta: 2. Los fármacos para la depresión proporcionan una respuesta de mejoría más rápida que los tratamientos psicológicos.